Cyclosporine 是一種有效的免疫抑制劑，經常用於器官移植之抗排斥作用，其原因為何？
A. 增加 IgG 抗體的合成
B. 干擾抗體的確認與結合
C. 抑制 Interleukins 基因轉錄作用
D. 活化 Natural killer（NK）細胞

正確答案：C. 抑制 Interleukins 基因轉錄作用